Clinical trial inclusion criterion:
Respiration rate 12-18 breaths per minute

Annotated entities:
- Measurement: "Respiration rate"
- Value: "12-18 breaths per minute"